Clinical trial inclusion criterion:
Clinically stable;

Annotated entities:
- Condition: "Clinically stable"